Clinical trial inclusion criterion:
Has Eastern Cooperative Oncology Group (ECOG) performance status of 0 or 1 performed within 7 days prior to receiving the first dose of study medication

Entity relations:
- Has_value("Eastern Cooperative Oncology Group (ECOG) performance status", "0 or 1")
- Has_index("within 7 days prior", "receiving the first dose of study medication")
- Has_temporal("Eastern Cooperative Oncology Group (ECOG) performance status", "within 7 days prior")